Clinical trial exclusion criterion:
Children with systemic illness that contraindicated vital pulp treatment such a sickle cell disease

Annotated entities:
- Condition: "systemic illness"
- Condition: "contraindicated"
- Procedure: "vital pulp treatment"
- Condition: "sickle cell disease"